Clinical trial exclusion criterion:
endocrine diseases: male hypogonadism, hyperthyroidism, adrenal diseases, pituitary diseases

Entity relations:
- Subsumes("endocrine diseases", "male hypogonadism")
- OR("male hypogonadism", "adrenal diseases", "hyperthyroidism", "pituitary diseases")